Body mass index (BMI) = 27 Kg/m2 and/or waist circumference = 102 cm (40 inches) in men and 88 cm (35 inches) in women, respectively.

The above is a clinical trial inclusion criterion. Annotated with entity spans:
[Measurement: Body mass index (BMI)] [Value: = 27 Kg/m2] and/or [Measurement: waist circumference] [Value: = 102 cm] ([Value: 40 inches]) in [Person: men] and [Value: 88 cm] ([Value: 35 inches]) in [Person: women], respectively.